Clinical trial exclusion criterion:
Malignancy within 5 years before Screening

Annotated entities:
- Condition: "Malignancy"
- Temporal: "within 5 years before Screening"
- Reference_point: "Screening"